臨床上 Prader-Willi 症候群及 Angelman 症候群是不一樣的疾病，但是檢驗時發現兩個不同診斷的病人卻有相同的 15 號染色體微小缺損。最有可能是什麼原因？
A. 因為兩位患者在其他染色體上有不同的變化
B. Prader-Willi 症候群患者之缺損染色體是遺傳自父親；Angelman 症候群患者之缺損染色體是遺傳自母親
C. 偵測染色體缺損之技術不精確
D. 這兩個疾病和這個缺損的區域無關

正確答案：B. Prader-Willi 症候群患者之缺損染色體是遺傳自父親；Angelman 症候群患者之缺損染色體是遺傳自母親